Subjects who currently participate in other clinical trial or participated in other clinical trial within 30 days

The above is a clinical trial exclusion criterion. Annotated with entity spans:
[Non-query-able: Subjects who currently participate in other clinical trial or participated in other clinical trial within 30 days]